Clinical trial exclusion criterion:
Alternative treatment for low back pain in previous two weeks

Entity relations:
- Has_temporal("low back pain", "in previous two weeks")
- Has_qualifier("treatment", "Alternative")
- AND("treatment", "low back pain")